有關 T 淋巴球（T lymphocytes）的敘述，下列何者正確？
A. 活化的 CD8+T 淋巴球（CD8+T lymphocytes）可分化成可分泌細胞激素的 TH1 或 TH2 細胞（cytokine-
B. 宿主對抗結核菌感染，CD4+T 淋巴球（CD4+T lymphocytes）的活化和增生是最重要的
C. TH1 細胞（TH1 cells）主要製造的細胞激素為干擾素（IFN-γ）以及介白質 4 和 5（interleukin-4 and interleukin-5）
D. TH2 細胞（TH2 cells）主要製造介白質 2、10 和 13（interleukin-2, interleukin-10 and interleukin-13）

正確答案：B. 宿主對抗結核菌感染，CD4+T 淋巴球（CD4+T lymphocytes）的活化和增生是最重要的